乳房原位癌患者必須接受全乳房切除，下列何者除外？
A. 首次局部乳房切除無法有乾淨邊緣（clear margin）
B. 瀰漫性乳管內鈣化點
C. 患者強烈無意願保留乳房
D. 患者無法接受放射線治療

正確答案：A. 首次局部乳房切除無法有乾淨邊緣（clear margin）